Clinical trial inclusion criterion:
Low or intermediate risk level surgery

Entity relations:
- OR("intermediate risk level surgery", "risk level surgery Low")